Clinical trial exclusion criterion:
2. Subject is pregnant or lactating or is attempting or expecting to become pregnant during the study

Annotated entities:
- Parsing_Error: "2."
- Condition: "pregnant"
- Condition: "lactating"
- Non-query-able: "is attempting or expecting to become pregnant during the study"
- Post-eligibility: "is attempting or expecting to become pregnant during the study"